下列與腹部腔室症候群（abdominal compartment syndrome）相關的症狀，何者錯誤？
A. 腹內壓突然增加
B. 小便量減少
C. 缺氧（hypoxia）
D. 血壓正常

正確答案：D. 血壓正常